一位 45 歲婦女，因腎臟大型鹿角結石（staghorn stone）（成分為磷酸銨鎂）併發急性腎盂腎炎（pyelonephritis）住院。該婦女若不接受治療，其死亡率如何？
A. 低於 10%
B. 10%至 30%
C. 30%至 50%
D. 50%至 70%

正確答案：B. 10%至 30%